下列有關無月經症（amenorrhea）的定義，何者正確？
A. 原發性無月經症是指 16 歲仍無月經，且無第二性徵
B. 原發性無月經症是指 14 歲仍無月經，但具正常第二性徵
C. 續發性無月經症是指已有月經的婦女連續月經停止 2 個月以上
D. 續發性無月經症是指已有月經的婦女連續月經停止 6 個月以上

正確答案：D. 續發性無月經症是指已有月經的婦女連續月經停止 6 個月以上